23. Hemoglobin concentration <9 g/dL at Screening.

The above is a clinical trial exclusion criterion. Annotated with entity spans:
[Parsing_Error: 23.] [Measurement: Hemoglobin concentration] [Value: <9 g/dL] [Temporal: at Screening].